Clinical trial inclusion criterion:
type 2 diabetic, age 18 and over, informed consent,

Entity relations:
- Has_value("age", "18 and over")